Clinical trial inclusion criterion:
Patient able to consent and comply with protocol requirements

Annotated entities:
- Informed_consent: "Patient able to consent and comply with protocol requirements"